Clinical trial exclusion criteria:
eGFR <60 T2DM patients on insulin, GLP-1 RA or SGLT2 treatment Major organ disease type 1 diabetes

Annotated entities:
- Measurement: "eGFR"
- Value: "<60"
- Condition: "T2DM"
- Drug: "insulin"
- Drug: "GLP-1"
- Drug: "RA"
- Drug: "SGLT2"
- Condition: "Major organ disease"
- Condition: "type 1 diabetes"
- Line: "eGFR <60"
- Line: "T2DM patients on insulin, GLP-1 RA or SGLT2 treatment"
- Line: "Major organ disease"
- Line: "type 1 diabetes"